Clinical trial exclusion criterion:
5. Severe chronic obstructive pulmonary disease

Annotated entities:
- Parsing_Error: "5."
- Condition: "chronic obstructive pulmonary disease"
- Qualifier: "Severe"